Clinical trial exclusion criterion:
Unability to give informed consent

Annotated entities:
- Observation: "give informed consent"
- Negation: "Unability to"